Left ventricular ejection fraction (LVEF) less than or equal to (=<) 40 percent (%).

The above is a clinical trial inclusion criterion. Annotated with entity spans:
[Measurement: Left ventricular ejection fraction] ([Measurement: LVEF]) [Value: less than or equal to] ([Value: =<]) 40 percent (%).